Clinical trial exclusion criterion:
use more than 2g a day; 5 times a week to everyday

Annotated entities:
- Multiplier: "more than 2g a day"
- Multiplier: "5 times a week to everyday"